Clinical trial inclusion criterion:
18 years old or older.

Entity relations:
- Has_value("old", "18 years or older")